What is CVT-301?

CVT-301 is inhaled levodopa (LD) formulation for development as a self-administered treatment for relief of OFF periods in Parkinson's disease.  CVT-301 provided rapid improvement of motor function, and daily OFF time was significantly reduced at the higher dose.